Clinical trial exclusion criterion:
pregnancy;

Annotated entities:
- Condition: "pregnancy"